Clinical trial inclusion criterion:
inability to cooperate with protocol requirements

Annotated entities:
- Non-query-able: "inability to cooperate with protocol requirements"